Clinical trial exclusion criterion:
2. Use of any medication known to alter hepatic enzyme activity within 28 days prior to the initial dose of study medication.

Entity relations:
- Has_index("within 28 days prior", "the initial dose of study medication")
- Has_temporal("medication known to alter hepatic enzyme activity", "within 28 days prior")